52歲更年期婦女，G2P2，體重60公斤，陰道超音波檢查有3公分的右側卵巢單純囊腫 （simple cyst），血中CA 125濃度為19 IU/mL。她本人不抽煙。直系家屬中無乳癌或卵巢癌的病人。進一步何者為最恰當的處置？
A. 做腹部或骨盆腔的電腦斷層檢查
B. 腹腔鏡手術
C. 三個月內再做一次陰道超音波
D. 服用口服避孕藥

正確答案：C. 三個月內再做一次陰道超音波